Clinical trial inclusion criterion:
Surgical candidate per pancreatobiliary surgeon after multi-disciplinary discussion

Entity relations:
- Has_qualifier("Surgical candidate", "per pancreatobiliary surgeon")